有關春季角結膜炎（Vernal keratoconjunctivitis）之特徵，下列敘述何者正確？
A. 與配戴隱形眼鏡有關
B. 好發於中年女性
C. 結膜抹片所見的發炎細胞以嗜鹼性白血球（Basophil）為主
D. 劇癢、分泌物多

正確答案：D. 劇癢、分泌物多